肺隔離（pulmonary sequestration）較常發生在何處？
A. 左上肺
B. 左下肺
C. 右上肺
D. 右下肺

正確答案：B. 左下肺